Basic understanding of the study as determined by the physician

The above is a clinical trial inclusion criterion. Annotated with entity spans:
[Non-query-able: Basic understanding of the study as determined by the physician]